Clinical trial exclusion criterion:
Liver or kidney failure.

Annotated entities:
- Condition: "Liver failure"
- Condition: "kidney failure"